Which type of genes are modulated by SATB1?

Repression of the genome organizer SATB1 in regulatory T cells is required for suppressive function and inhibition of effector differentiation